Clinical trial exclusion criterion:
Respiratory exacerbation within the 2 months preceding the study

Annotated entities:
- Condition: "Respiratory exacerbation"
- Temporal: "within the 2 months preceding the study"
- Reference_point: "the study"